Previous vaccination against diphtheria, tetanus, pertussis, polio, hepatitis B, Haemophilus influenzae type b, and/or S. pneumoniae with the exception of vaccines where the first dose can be given within the first two weeks of life according to the national recommendations

The above is a clinical trial exclusion criterion. Annotated with entity spans:
Previous [Drug: vaccination] against [Condition: diphtheria], [Condition: tetanus], [Condition: pertussis], [Condition: polio], [Condition: hepatitis B], [Condition: Haemophilus influenzae type b], and/or [Condition: S. pneumoniae] [Negation: with the exception of] [Drug: vaccines] where the [Qualifier: first dose can be given] [Temporal: within the first two weeks of life] according to the national recommendations